下列何者作用在 membrane-bound 的 guanylate cyclase？
A. atrial natriuretic peptide（ANP）
B. nitric oxide
C. insulin
D. norepinephrine

正確答案：A. atrial natriuretic peptide（ANP）